Clinical trial exclusion criterion:
High bleeding risk; such as platelets <50,000 / mm3 during screening, Hb <8.5 g / dL, history of intracranial hemorrhage or subdural hematoma, major surgery, parenchymal organ biopsy or severe trauma within 30 days before inclusion, active gastrointestinal ulcer in the last 3 months;

Annotated entities:
- Observation: "bleeding risk"
- Qualifier: "High"
- Measurement: "platelets"
- Value: "<50,000 / mm3"
- Measurement: "Hb"
- Value: "<8.5 g / dL"
- Condition: "intracranial hemorrhage"
- Condition: "subdural hematoma"
- Procedure: "major surgery,"
- Procedure: "parenchymal organ biopsy"
- Condition: "trauma"
- Qualifier: "severe"
- Temporal: "within 30 days"
- Qualifier: "active"
- Condition: "gastrointestinal ulcer"
- Temporal: "last 3 months"